Clinical trial exclusion criterion:
Use of prazosin or other alpha-1 antagonist (including but not limited to alfuzosin, doxazosin, silodosin, tamsulosin, terazosin) for any purpose in the 2 weeks prior to initial screen (P1) visit and prohibited throughout the study

Entity relations:
- Has_index("in the 2 weeks prior to initial screen (P1) visit", "initial screen (P1) visit")
- Has_qualifier("alpha-1 antagonist", "other")
- Subsumes("prazosin", "alfuzosin")
- Has_temporal("prazosin", "in the 2 weeks prior to initial screen (P1) visit")
- OR("prazosin", "alpha-1 antagonist")
- OR("alfuzosin", "doxazosin", "silodosin", "tamsulosin", "terazosin")